Where are integrins localized in a cell?

Integrins are transmembrane glycoproteins that are broadly distributed in living organisms.